Adult patients ≥ 19 years of age who are able to freely provide informed consent

The above is a clinical trial inclusion criterion. Annotated with entity spans:
[Person: Adult] patients [Value: ≥ 19 years] of [Person: age] who are [Observation: able to freely provide informed consent]